 Second group : healthy volunteers

The above is a clinical trial inclusion criterion. Annotated with entity spans:
 Second group : [Observation: healthy] volunteers